Clinical trial exclusion criterion:
History of cancer (within the last year)

Entity relations:
- Has_temporal("cancer", "last year")